Clinical trial inclusion criterion:
If all lab results for quantitative IgA immunoglobulin level are lower than 15% below normal range, the subject may not proceed further in the screening process.

Annotated entities:
- Measurement: "quantitative IgA immunoglobulin level"
- Value: "lower than 15% below normal range"
- Context_Error: "If all lab results for quantitative IgA immunoglobulin level are lower than 15% below normal range, the subject may not proceed further in the screening process"